腋下淋巴結廓清時，若遭切斷，會造成上臂內側麻木或疼痛的神經為何？
A. long thoracic nerve
B. thoracodorsal nerve
C. intercostobrachial nerve
D. medial pectoral nerve

正確答案：C. intercostobrachial nerve